Clinical trial exclusion criterion:
(4)Diagnosis or suspicion of secondary hypertension;

Annotated entities:
- Condition: "secondary hypertension"
- Mood: "suspicion"
- Mood: "Diagnosis"